La gestión por procesos es:
1. Un método de gestión, orientado a secuenciar los procesos de suministro de materiales a las Unidades clínicas, para reducir los tiempos de reposición y el espacio destinado a almacenamiento.
2. El procesamiento de la información, a través de soportes electrónicos, para agilizar la toma de decisiones entre Servicios o Unidades que no están próximos entre sí, válido tanto para los Centro de Salud como para los hospitales.
3. Una forma de gestionar, en la que se priorizan los procedimientos administrativos, a fin de situar en primer plano los relacionados con el cliente (o usuario) y se relegan al nivel inferior los procedimientos relacionados con la gestión económico-financiera.
4. Un sistema de trabajo enfocado a conseguir la mejora continua del funcionamiento de una organización mediante la identificación, la selección, la descripción, la documentación y la mejora de procesos.
5. Una variante de la planificación presupuestaria en base cero, en la que, durante el proceso planificador se trata de adecuar los medios a los objetivos en cada uno de los Departamentos, Servicios o Unidades de la Institución.

Respuesta correcta: 4. Un sistema de trabajo enfocado a conseguir la mejora continua del funcionamiento de una organización mediante la identificación, la selección, la descripción, la documentación y la mejora de procesos.